Clinical trial inclusion criterion:
35-75 years old;

Entity relations:
- Has_value("old", "35-75 years old")